Clinical trial exclusion criterion:
Internal, neurologic, rheumatologic or psychiatric disease including current heavy smoking (>20 cigarettes per day)

Entity relations:
- Has_value("cigarettes per day", ">20")
- Has_qualifier("smoking", "heavy")
- Subsumes("smoking", "cigarettes per day")
- Has_temporal("smoking", "current")
- Has_qualifier("disease", "Internal")
- Has_context("Internal", "smoking")
- Has_temporal("cigarettes per day", "current")
- OR("Internal", "rheumatologic", "neurologic", "psychiatric")